下列何種檢查為診斷 gastroesophageal reflux disease（GERD）的黃金標準（golden standard）？
A. double-contrast esophagography
B. 上消化道內視鏡（upper gastrointestinal endoscopy）
C. 食道壓測試（manometry）
D. ambulatory 24-hour pH monitoring

正確答案：D. ambulatory 24-hour pH monitoring